Clinical trial exclusion criterion:
Patients with severe uncontrolled hypertension with systolic BP > 220mmHg or diastolic BP > 120mmHg;

Entity relations:
- Has_value("systolic BP", "> 220mmHg")
- Has_value("diastolic BP", "> 120mmHg")
- Has_qualifier("hypertension", "uncontrolled")
- Has_qualifier("hypertension", "severe")
- AND("hypertension", "systolic BP")
- OR("systolic BP", "diastolic BP")